En la fisiopatología de la úlcera péptica. ¿Cuál es la FALSA?
1. Gran parte de las úlceras gastro-duodenales se pueden atribuir a la infección por H. pylori o lesión mucosa por AINEs.
2. H. pylori no se relaciona con el desarrollo de linfoma gástrico.
3. La transmisión de H. pylori se produce de persona a persona vía oral-oral o fecal-oral.
4. Un menor nivel educativo y un estatus socioeconómico bajo predisponen a mayores índices de colonización.
5. La incidencia de adenocarcinoma gástrico es mayor en pacientes portadores del H. Pylori.

Respuesta correcta: 2. H. pylori no se relaciona con el desarrollo de linfoma gástrico.